Patients requiring surgery for neoplastic processes

The above is a clinical trial exclusion criterion. Annotated with entity spans:
Patients requiring [Procedure: surgery] for [Condition: neoplastic processes]